Clinical trial exclusion criterion:
Acute critical limb ischemia

Entity relations:
- Has_qualifier("limb ischemia", "critical")
- Has_temporal("limb ischemia", "Acute")